有關胰十二指腸切除術（pancreaticoduodenectomy）之敘述，何者錯誤？
A. 常用來治療胰頭癌之病患
B. Pylorus-preserving pancreaticoduodenectomy（PPPD）術後比 standard Whipple operation 易發生延遲性胃排空（delayed gastric emptying）
C. PPPD 通常在 gastric antrum 處切斷
D. 胰頸處（neck of the pancreas）需被切斷

正確答案：C. PPPD 通常在 gastric antrum 處切斷